Clinical trial exclusion criterion:
Patients' age less than 65 years;

Annotated entities:
- Value: "less than 65 years"
- Person: "age"